對於第二型子宮內膜癌（type II endometrial cancer）的特徵之敘述，下列何者較適當？①常與雌激素過度刺激無關 ②多為low grade endometrioid type 的病理形態 ③多為停經以後的年長女性 ④預後通常比第 一型子宮內膜癌差 ⑤常與子宮內膜增生有關（endometrial hyperplasia）
A. ①②③⑤
B. ①③④
C. ②⑤
D. ②③⑤

正確答案：B. ①③④